一旦直腸陰道瘻管被確定診斷後，初步的治療方法應選擇：
A. 進行結腸造瘻術
B. 切除瘻管段的直腸，再直接縫合
C. 經陰道縫合瘻管
D. 先給予類固醇及抗生素

正確答案：C. 經陰道縫合瘻管